¿Cuáles son las aptitudes relacionadas con el mundo externo, que R.J. Sternberg propone en su Teoría Triárquica de la Inteligencia?:
1. La habilidad para manejar la novedad y automatizar procesos.
2. Los componentes de ejecución, dirigidos a ejecutar la relación con el mundo externo.
3. Los componentes de adquisición del conocimiento que se aprenden en contacto con el mundo externo.
4. La capacidad de adaptarse, modificar y seleccionar el ambiente.

Respuesta correcta: 4. La capacidad de adaptarse, modificar y seleccionar el ambiente.